Clinical trial exclusion criterion:
Structural brain abnormalities on any prior imaging with associated clinically evident manifestations

Entity relations:
- Has_qualifier("imaging", "any")
- Has_temporal("imaging", "prior")
- AND("Structural brain abnormalities", "imaging")
- Has_qualifier("manifestations", "clinically evident")
- AND("Structural brain abnormalities", "manifestations")